對周邊血管阻塞的治療，下列何者並不適當？
A. 照光（phototherapy）
B. 控制高血壓，給與乙型阻斷劑
C. 控制糖尿病
D. 以導管方式打通血管

正確答案：A. 照光（phototherapy）